Clinical trial inclusion criterion:
Patient must have level of serum testosterone above the lower limit of normal.

Annotated entities:
- Measurement: "level of serum testosterone"
- Value: "above the lower limit of normal"